Clinical trial exclusion criterion:
Uremia patients under hemodialysis or continuous ambulatory peritoneal dialysis or patients with Ccr < 50 mL/min

Annotated entities:
- Condition: "Uremia"
- Procedure: "hemodialysis"
- Condition: "continuous ambulatory peritoneal dialysis"
- Measurement: "Ccr"
- Value: "< 50 mL/min"